Clinical trial inclusion criterion:
Subject has confirmed Pulmonary Hypertension and Interstitial Lung Disease

Entity relations:
- Has_mood("Pulmonary Hypertension", "confirmed")
- Has_mood("Interstitial Lung Disease", "confirmed")